外展神經核（abducens nucleus）的最主要功能為：
A. 一般體傳入（general somatic afferent）
B. 特殊內臟傳出（special visceral efferent）
C. 一般體傳出和一般內臟傳出（general somatic efferent and general visceral efferent）
D. 一般體傳出（general somatic efferent）

正確答案：D. 一般體傳出（general somatic efferent）